Clinical trial exclusion criterion:
Adults older than 45 and children younger than 18 years

Entity relations:
- Has_value("children", "younger than 18 years")
- Has_value("Adults", "older than 45")